Pregnant (as evidenced by positive pregnancy test) or nursing women

The above is a clinical trial exclusion criterion. Annotated with entity spans:
[Condition: Pregnant] (as evidenced by [Value: positive] [Measurement: pregnancy test]) or [Observation: nursing] [Person: women]